Clinical trial inclusion criterion:
Patients must have a VAS (Visual analog scale) >=40mm

Annotated entities:
- Measurement: "VAS (Visual analog scale)"
- Value: ">=40mm"